Clinical trial exclusion criterion:
7. Acute or chronic renal dysfunction (creatinine greater than 2.5 mg/dl or less than 150µmol/L).

Annotated entities:
- Condition: "chronic renal dysfunction"
- Condition: "Acute renal dysfunction"
- Measurement: "creatinine"
- Value: "greater than 2.5 mg/dl"
- Value: "less than 150µmol/L"